current participation in another clinical trial or participation in another clinical trial within the last 4 weeks

The above is a clinical trial exclusion criterion. Annotated with entity spans:
[Non-query-able: current participation in another clinical trial or participation in another clinical trial within the last 4 weeks]